Clinical trial inclusion criteria:
Patient age >= 18 years
Zubrod performance status of 0-3
T1-3 N0 M0 adenocarcinoma of the prostate
Prostate volume = 100 cc
Signed study-specific consent form
Extension of local tumor to involve adjacent organs other than seminal vesicles (T4)
Prostate volume > 100 cc
Nodal involvement
Metastatic disease
Prior pelvic radiotherapy except as part of combination therapy for prostate cancer
History of scleroderma
Patients with psychiatric or addictive disorder that would preclude obtaining informed consent

Annotated entities:
- Person: "Patient age"
- Value: ">= 18 years"
- Measurement: "Zubrod performance status"
- Value: "0-3"
- Measurement: "T"
- Value: "1-3"
- Measurement: "N"
- Measurement: "M"
- Value: "0"
- Value: "0"
- Condition: "adenocarcinoma"
- Qualifier: "prostate"
- Measurement: "Prostate volume"
- Value: "= 100 cc"
- Informed_consent: "Signed study-specific consent form"
- Condition: "Extension of local tumor"
- Qualifier: "adjacent organs"
- Negation: "other than"
- Qualifier: "seminal vesicles"
- Measurement: "Prostate volume"
- Value: "> 100 cc"
- Condition: "Nodal involvement"
- Condition: "Metastatic disease"
- Temporal: "Prior"
- Qualifier: "pelvic"
- Procedure: "radiotherapy"
- Negation: "except"
- Procedure: "combination therapy"
- Condition: "prostate cancer"
- Condition: "prostate cancer"
- Temporal: "History"
- Condition: "scleroderma"
- Condition: "psychiatric disorder"
- Condition: "addictive disorder"